Clinical trial exclusion criterion:
Patients with clinically unstable cardiac arrhythmias, such as recurrent ventricular tachycardia.

Annotated entities:
- Qualifier: "clinically unstable"
- Condition: "cardiac arrhythmias"
- Condition: "ventricular tachycardia"
- Multiplier: "recurrent"